胎兒的性別發育過程當中，那個事件是最早發生？
A. 苗勒氏管（Müllerian duct）的退化
B. 伏耳夫氏管（Wölffian duct）的退化
C. 伏耳夫氏管的分化
D. 苗勒氏管的分化

正確答案：A. 苗勒氏管（Müllerian duct）的退化